Clinical trial exclusion criteria:
Patients who had history of systemic antibiotic usage over the previous 4 months
Patients who were pregnant
Patients who had received non-surgical periodontal treatment within the past 6 months
Patients who had received surgical periodontal treatment within the past 12 months
Patients who were smokers
Patients with a history of stroke or an acute cardiovascular event over the previous 12 months.

Annotated entities:
- Drug: "systemic antibiotic"
- Temporal: "over the previous 4 months"
- Temporal: "history"
- Condition: "pregnant"
- Procedure: "non-surgical periodontal treatment"
- Temporal: "within the past 6 months"
- Procedure: "surgical periodontal treatment"
- Temporal: "within the past 12 months"
- Condition: "smokers"
- Condition: "stroke"
- Procedure: "acute cardiovascular event"
- Temporal: "over the previous 12 months"